Patients must have a Zubrod performance status of 0-2.

The above is a clinical trial inclusion criterion. Annotated with entity spans:
Patients must have a [Measurement: Zubrod performance status] of [Value: 0-2].